Clinical trial inclusion criterion:
With confirmed diagnosis of stage II colon cancer.

Annotated entities:
- Condition: "colon cancer"
- Qualifier: "stage II"